Clinical trial exclusion criterion:
Single shot local nerve block prior to surgery was ineffective

Entity relations:
- Has_multiplier("local nerve block", "Single shot")
- Has_index("prior to surgery", "surgery")
- Has_temporal("local nerve block", "prior to surgery")